Clinical trial exclusion criterion:
16. Severe anemia (Hb <10 mg/dL).

Entity relations:
- Has_value("Hb", "<10 mg/dL")
- Has_qualifier("anemia", "Severe")
- Subsumes("Severe", "Hb")